一舌癌病人，腫瘤大小為4.5 × 2.5公分，舌部活動正常且未侵犯鄰近構造。同側頸部有一4公分的轉移淋巴 結，但無明顯淋巴結外侵犯（extranodal extension）情形。依據AJCC第7版（或第8版）的癌症分期系統，其臨床分期應為：
A. T2N1，stage III
B. T2N2a，stage IVA
C. T3N1，stage III
D. T3N2a，stage IVA

正確答案：D. T3N2a，stage IVA